目前治療 B 型肝炎的藥物，不包括下列何者？
A. 貝樂克（entecavir）
B. 喜必福（telbivudine）
C. 干安能（lamivudine）
D. 雷巴威林（ribavirin）

正確答案：D. 雷巴威林（ribavirin）